Women with one prior low transverse cesarean delivery

The above is a clinical trial inclusion criterion. Annotated with entity spans:
[Person: Women] with [Multiplier: one] prior [Procedure: low transverse cesarean delivery]